Habitual use of opioids

The above is a clinical trial exclusion criterion. Annotated with entity spans:
[Multiplier: Habitual use] of [Drug: opioids]